中年婦女長年腎病，死後解剖，腎臟較小，且表面有無數1-3 mm之凹陷，下列那一項是其組織變化？
A. 水腫
B. 膿瘍
C. 疤瘢纖維化
D. 嗜中性球浸潤

正確答案：C. 疤瘢纖維化